Clinical trial exclusion criterion:
patients with Hb values < 11 g/dl and platelet values < 150,000/mmc.

Entity relations:
- Has_value("Hb", "< 11 g/dl")
- Has_value("platelet", "< 150,000/mmc")
- OR("Hb", "platelet")